在後腹壁，沿薦椎翼（ala）下行，組成薦神經叢的神經為：
A. 閉孔神經（obturator nerve）
B. 股神經（femoral nerve）
C. 腰薦神經幹（lumbosacral trunk）
D. 生殖股神經（genitofemoral nerve）

正確答案：C. 腰薦神經幹（lumbosacral trunk）